Have used any systemic or topical antibiotics for ocular infection in the previous 14 days.

The above is a clinical trial exclusion criterion. Annotated with entity spans:
Have used any [Drug: systemic] or [Drug: topical antibiotics] for [Condition: ocular infection] [Temporal: in the previous 14 days].